Clinical trial inclusion criterion:
Stable tacrolimus dose for at least 2 weeks prior to randomization

Entity relations:
- Has_index("for at least 2 weeks prior to randomization", "randomization")
- Has_temporal("tacrolimus", "for at least 2 weeks prior to randomization")
- Has_qualifier("tacrolimus", "Stable dose")